The pathogen Fusarium graminearum affects what type of plant species?

Fusarium graminearum is a broad host pathogen threatening cereal crops in temperate regions around the world.